Concurrent treatment with a 5-a-reductase inhibitor

The above is a clinical trial exclusion criterion. Annotated with entity spans:
Concurrent treatment with a [Drug: 5-a-reductase inhibitor]